Clinical trial exclusion criterion:
Contraindications for magnetic resonance imaging

Entity relations:
- AND("Contraindications", "magnetic resonance imaging")